Inability to use verbal or pictorial pain scoring scales

The above is a clinical trial exclusion criterion. Annotated with entity spans:
[Condition: Inability] to use [Procedure: verbal] or [Procedure: pictorial pain scoring scales]